ANC ≥ 1.5 x 109/L

The above is a clinical trial inclusion criterion. Annotated with entity spans:
[Measurement: ANC] [Value: ≥ 1.5 x 109/L]